Clinical trial exclusion criterion:
Participation in any clinical studies within the last 4 weeks;

Entity relations:
- Has_temporal("Participation in any clinical studies", "within the last 4 weeks")